Clinical trial exclusion criterion:
Biliary strictures caused by malignancies other than pancreatic cancer, distal CBD cholangiocarcinoma and other periampullary cancers

Annotated entities:
- Condition: "Biliary strictures"
- Condition: "malignancies"
- Negation: "other than"
- Condition: "pancreatic cancer"
- Condition: "distal CBD cholangiocarcinoma"
- Condition: "other periampullary cancers"